Clinical trial exclusion criterion:
9. Any Grade 2, 3 or 4 baseline haematology, chemistry or urinalysis laboratory abnormality according to the DAIDS Table for Grading Adverse Experiences

Annotated entities:
- Condition: "laboratory abnormality"
- Condition: "urinalysis abnormality"
- Condition: "chemistry abnormality"
- Condition: "haematology abnormality"
- Value: "Grade 2, 3 or 4"
- Temporal: "baseline"
- Measurement: "DAIDS Table for Grading Adverse Experiences"
- Procedure: "haematology"
- Procedure: "chemistry"
- Procedure: "urinalysis"
- Procedure: "laboratory"